Clinical trial inclusion criterion:
Patients undergoing an operation that is scheduled to last more than 2 hours

Annotated entities:
- Procedure: "operation"
- Qualifier: "scheduled to last more than 2 hours"
- Temporal: "last more than 2 hours"
- Undefined_semantics: "scheduled to last more than 2 hours"
- Non-query-able: "scheduled to last more than 2 hours"